一位中年男性肝硬化病患因神智不清被送入醫院，身體檢查發現腹部明顯腫脹並有shifting dullness，手掌有flapping tremor，實驗室檢查發現血清ammonia及膽紅素升高，但白蛋白降低，腎功能正常，抽取腹水檢查發現中性白血球數大於 500/mm3。則下列何項治療錯誤？
A. cefotaxime
B. ampicillin 加上 tobramycin
C. lactulose
D. 靜脈注射白蛋白

正確答案：B. ampicillin 加上 tobramycin